55 歲男性有嚼檳榔、抽菸及喝酒的習慣約 15 年，最近半年在左舌側出現約 1.5 公分的腫瘤，理學檢查發現在同側下頜三角有一 2 公分淋巴腫，舌切片檢查證實為舌部鱗狀上皮細胞癌（squamous cell carcinoma），請問此病患的癌症臨床分期為第幾期？
A. 第一期（stage I）
B. 第二期（stage II）
C. 第三期（stage III）
D. 第四期（stage IV）

正確答案：C. 第三期（stage III）